低血鈣合併高副甲狀腺荷爾蒙血清濃度，應考慮下列何種疾病？
A. hereditary hypoparathyroidism
B. pseudohypoparathyroidism
C. pseudopseudohypoparathyroidism
D. severe hypomagnesemia

正確答案：B. pseudohypoparathyroidism